En relación a la Esferocitosis Hereditaria es cierto que:
1. Es una anemia hemolítica congénita de herencia ligada al cromosoma X que es causa anemia severa.
2. Se caracteriza por una disminución de la fragilidad osmótica.
3. Se manifiesta como episodios de anemia aguda medicamentosa.
4. El tratamiento de elección cuando es sintomática es la esplenectomía.
5. Raramente se asocia a colelitiasis.

Respuesta correcta: 4. El tratamiento de elección cuando es sintomática es la esplenectomía.